Clinical trial inclusion criterion:
Neutrophil count: ≥ 1.5 x 109/L

Annotated entities:
- Value: "≥ 1.5 x 109/L"
- Measurement: "Neutrophil count"